張太太為75歲家庭主婦，最近三個月來抱怨走路走個十來分	兩下肢就會酸痛、麻木，但是坐一下子症狀立 即改善，又可繼續走下去。下列何種檢查對診斷最有幫助？
A. 腰椎一般X光檢查（plain x-ray）
B. 肌電圖檢查（EMG）
C. 神經傳導檢查（NCS）
D. 磁振造影檢查（MRI）

正確答案：D. 磁振造影檢查（MRI）